下列那一種狀況發生胎盤早期剝離（plancental abruption ）的風險最高？
A. 前一胎發生胎盤早期剝離
B. 合併子癇前症（preeclampsia ）
C. 絨毛膜羊膜炎（chorioamnionitis ）
D. 胎膜早破（premature rupture of membranes ）

正確答案：A. 前一胎發生胎盤早期剝離